Clinical trial exclusion criterion:
Contraindications to exposure to a magnetic field

Entity relations:
- AND("Contraindications", "magnetic field")